下列何種檢查，是診斷足癬（tinea pedis）敏感且快速的方法？
A. 皮屑之 KOH 鏡檢法
B. 黴菌的培養
C. 伍氏燈檢查
D. 皮膚切片病理檢查

正確答案：A. 皮屑之 KOH 鏡檢法